Currently receiving immunosuppressive or myelosuppressive therapy with, for example, monoclonal antibodies, methotrexate, cyclophosphamide, cyclosporine or azathioprine, or chronic use of corticosteroids.

The above is a clinical trial exclusion criterion. Annotated with entity spans:
[Temporal: Currently] receiving [Procedure: immunosuppressive] or [Procedure: myelosuppressive therapy] with, for example, [Drug: monoclonal antibodies], [Drug: methotrexate], [Drug: cyclophosphamide], [Drug: cyclosporine] or [Drug: azathioprine], or [Multiplier: chronic use] of [Drug: corticosteroids].